Respecto al tratamiento inmunosupresor actual utilizado en el trasplante renal es cierto todo EXCEPTO:
1. El tacrolimus se usa menos que la ciclosporina porque asocia mayor riesgo de diabetes.
2. El micofenolato mofetil inhibe la síntesis de purinas y puede producir diarrea.
3. Los esteroides son coadyuvantes de otros inmusupresores, bloquean transcripción de interleucinas y se suelen usar en el rechazo agudo.
4. Sirolimus suele usarse en combinación con otros y puede causar hiperlipidemia.

Respuesta correcta: 1. El tacrolimus se usa menos que la ciclosporina porque asocia mayor riesgo de diabetes.